Es un intermediario en la síntesis de colesterol:
1. Malonil-CoA.
2. 3-Hidroxi-3-metilglutaril-CoA.
3. Propionil-CoA.
4. Butiril-CoA.

Respuesta correcta: 2. 3-Hidroxi-3-metilglutaril-CoA.